一位 45 歲女性長期內側踝關節疼痛，墊腳尖行走會疼痛，掌屈（plantar flexion）情況下作腳掌內翻 （inversion）肌力測試時會疼痛。此顯示下列那一條肌腱最可能已經受傷？
A. 脛後肌肌腱（posterior tibialis tendon）
B. 屈趾長肌肌腱（flexor digitorum longus tendon）
C. 屈腳拇趾長肌肌腱（flexor hallucis longus tendon）
D. 腓骨長肌肌腱（peroneus longus tendon）

正確答案：A. 脛後肌肌腱（posterior tibialis tendon）